Clinical trial exclusion criterion:
5. non reassuring fetal heart rate.

Annotated entities:
- Measurement: "fetal heart rate"
- Qualifier: "non reassuring"
- Subjective_judgement: "non reassuring"
- Context_Error: "non reassuring"